Clinical trial inclusion criterion:
Fibromyalgia: by ACR (American College of Rheumatology) 2010 criteria

Annotated entities:
- Condition: "Fibromyalgia"
- Qualifier: "American College of Rheumatology"
- Qualifier: "ACR 2010 criteria"